Left ventricular ejection fraction <45%

The above is a clinical trial exclusion criterion. Annotated with entity spans:
[Measurement: Left ventricular ejection fraction] [Value: <45%]